Clinical trial inclusion criterion:
Hemoglobin ≥ 8.0 g/dl

Entity relations:
- Has_value("Hemoglobin", "≥ 8.0 g/dl")